Clinical trial exclusion criterion:
Renal failure (eGFR <30 or requiring dialysis)

Entity relations:
- Has_mood("dialysis", "requiring")
- Has_value("eGFR", "<30")
- Subsumes("Renal failure", "eGFR")
- OR("eGFR", "dialysis")